¿Cuál de los siguientes microorganismos está implicado con mayor frecuencia en la Enfermedad Inflamatoria Pélvica?:
1. Cándida albicans.
2. Treponema pallidum.
3. Chlamydia trachomatis.
4. Trichomona vaginalis.

Respuesta correcta: 3. Chlamydia trachomatis.